Clinical trial inclusion criterion:
Subject has rapid joint disease, bone absorption, osteopenia, osteomalacia, and/or osteoporosis. Osteoporosis or osteopenia are relative contraindications, since this condition may limit the degree of obtainable correction and/or the amount of mechanical fixation.

Annotated entities:
- Condition: "rapid joint disease"
- Condition: "bone absorption"
- Condition: "osteopenia"
- Condition: "osteomalacia"
- Condition: "osteoporosis"
- Condition: "Osteoporosis"
- Condition: "osteopenia"
- Condition: "contraindications"
- Qualifier: "relative"